Histologically or cytologically confirmed diagnosis of adenocarcinoma of the colon or rectum.

The above is a clinical trial inclusion criterion. Annotated with entity spans:
[Procedure: Histologically] or [Procedure: cytologically] [Value: confirmed] diagnosis of [Condition: adenocarcinoma] of the [Qualifier: colon] or [Qualifier: rectum].